1 個月大男嬰因反覆抽搐而住院，實驗室檢查發現血鈣 1.2 mmol/L（正常值 2-2.75 mmol/L），血磷 11 mg/dL（正常值 5-7 mg/dL），血中副甲狀腺素（iPTH）< 1 pg/mL（正常值 17-76 pg/mL），而在一兩星期適當治療後，血鈣 2.11 mmol/L，血磷 6 mg/dL，此時 iPTH 為 59.7 pg/mL，則下列那一種診斷最符合上述檢驗值變化？
A. 慢性腎衰竭（兩側性腎臟發育不良）
B. CATCH 22 症候群
C. 低血鎂症
D. 新生兒維他命 D 缺乏（neonatal vitamin D deficiency）

正確答案：C. 低血鎂症